Systolic pressure =180 mmHg or diastolic pressure =110 mmHg;

The above is a clinical trial exclusion criterion. Annotated with entity spans:
[Measurement: Systolic pressure] [Value: =180 mmHg] or [Measurement: diastolic pressure] [Value: =110 mmHg];